Clinical trial exclusion criterion:
16. Women who are breastfeeding or pregnant as evidenced by positive serum pregnancy test

Entity relations:
- Has_value("serum pregnancy test", "positive")
- AND("breastfeeding", "serum pregnancy test")
- OR("breastfeeding", "pregnant")